Active medical conditions with known mood changes (endocrine, autoimmune disorders).

The above is a clinical trial exclusion criterion. Annotated with entity spans:
[Non-query-able: Active medical conditions with known mood changes] ([Condition: endocrine], [Condition: autoimmune disorders]).